一位心臟停止的病人被送來急診，急診醫師已插入氣管內管，這時候呼吸通氣速率最恰當為？
A. 每4秒給一次呼吸
B. 每6秒給一次呼吸
C. 每8秒給一次呼吸
D. 每10秒給一次呼吸

正確答案：B. 每6秒給一次呼吸